El interés toxicológico del pelo se debe a que:
1. Su análisis permite conocer la exposición a tóxicos en el pasado.
2. El cambio en su coloración puede facilitar el diagnóstico de la intoxicación.
3. Constituye una eficaz barrera protectora frente a la acción de los corrosivos.
4. Su crecimiento se interrumpe con el consumo crónico de anfetaminas.
5. El análisis del pelo carece de interés en Toxicología.

Respuesta correcta: 1. Su análisis permite conocer la exposición a tóxicos en el pasado.